Clinical trial inclusion criterion:
ASA physical status I-III;

Annotated entities:
- Measurement: "ASA physical status"
- Value: "I-III"